Clinical trial exclusion criterion:
Cervical cytology other than PAP I or PAP II (Papanicolaou) or cervical high risk human papillomavirus (HPV) positivity

Entity relations:
- Subsumes("human papillomavirus", "HPV")
- Has_qualifier("human papillomavirus", "cervical high risk")
- Has_value("Cervical cytology", "positivity")
- Has_negation("PAP I", "other")
- Has_qualifier("Cervical cytology", "PAP I")
- OR("PAP I", "PAP II", "Papanicolaou")
- OR("PAP I", "human papillomavirus")